下列何者不是第四型的過敏反應？
A. 結核病
B. 類肉瘤病（sarcoidosis）
C. B型肝炎
D. 痲瘋（leprosy）

正確答案：C. B型肝炎